Clinical trial inclusion criterion:
Intra-Ocular Pressure (IOP) is under control (i.e., IOP ≤ 25 mm in the study eye) and study eye is not receiving any IOP lowering drops.

Entity relations:
- Has_value("IOP", "≤ 25 mm")
- Has_qualifier("IOP", "in the study eye")
- Has_value("Intra-Ocular Pressure (IOP)", "under control")
- Has_negation("IOP lowering drops", "not")
- Has_qualifier("IOP lowering drops", "study eye")
- AND("Intra-Ocular Pressure (IOP)", "IOP")